Estimated life expectancy of at least 6 weeks following study entry

The above is a clinical trial inclusion criterion. Annotated with entity spans:
[Measurement: Estimated life expectancy] of [Value: at least 6 weeks following study entry]